Hormone treatment within the last 2 months

The above is a clinical trial exclusion criterion. Annotated with entity spans:
[Procedure: Hormone treatment] [Temporal: within the last 2 months]